Inability to complete 400 m walk within 15 minutes without sitting or interpersonal assistance, as an indicator of disablement and likely inability to fully engage in the exercise intervention

The above is a clinical trial exclusion criterion. Annotated with entity spans:
[Condition: Inability to complete 400 m walk within 15 minutes without sitting] or [Condition: interpersonal assistance], as an indicator of disablement and likely inability to fully engage in the exercise intervention